Must be currently smoking at least ½ pack/day at baseline (confirmed with cotinine level and CO Smokerlyzer

The above is a clinical trial inclusion criterion. Annotated with entity spans:
Must be currently [Observation: smoking] [Value: at least ½] [Measurement: pack/day] [Temporal: at baseline] (confirmed with [Procedure: cotinine level] and [Procedure: CO Smokerlyzer]